Have normal screening laboratories for urine protein and urine glucose

The above is a clinical trial inclusion criterion. Annotated with entity spans:
Have [Value: normal] screening laboratories for [Measurement: urine protein] and [Measurement: urine glucose]